List diseases caused by protein glutamine expanded repeats

Huntington's Disease,
dentatorubral-pallidoluysian atrophy